Clinical trial exclusion criterion:
Patients presenting with gastroesophageal reflux disease, peptic ulcer.

Entity relations:
- OR("gastroesophageal reflux disease", "peptic ulcer")